Clinical trial inclusion criterion:
Has read, understood and signed the information consent letter.

Annotated entities:
- Post-eligibility: "Has read, understood and signed the information consent letter."
- Non-query-able: "Has read, understood and signed the information consent letter."